List proteins that promotes calcification.

tissue nonspecific alkaline phosphatase (TNAP)
matrix Gla protein (MGP)
fibroblast growth factor-23 (FGF-23)
matrix metalloproteinases